8) provision of informed consent. In addition, all subjects who meet criteria for the training portion must complete an exercise tolerance test and be cleared for participation by the study cardiologist.

The above is a clinical trial inclusion criterion. Annotated with entity spans:
[Parsing_Error: 8)] [Non-query-able: provision of informed consent.] [Post-eligibility: In addition, all subjects who meet criteria for the training portion must complete an exercise tolerance test and be cleared for participation by the study cardiologist.]